Contact lens-wear during study

The above is a clinical trial exclusion criterion. Annotated with entity spans:
[Observation: Contact lens-wear] [Temporal: during study]